Subject with a spinal cord injury

The above is a clinical trial exclusion criterion. Annotated with entity spans:
Subject with a [Condition: spinal cord injury]